Infected with HIV

The above is a clinical trial exclusion criterion. Annotated with entity spans:
Infected with [Condition: HIV]